Clinical trial exclusion criterion:
Subjects who based on history or mental status examination have a significant risk of committing suicide, in the investigator's opinion.

Annotated entities:
- Procedure: "mental status examination"
- Observation: "risk of committing suicide"
- Qualifier: "significant"
- Non-query-able: "in the investigator's opinion"